What is evaluated with the Hydrocephalus Outcome Questionnaire?

The Hydrocephalus Outcome Questionnaire (HOQ) is a simple, reliable, and valid measure of health status in children with hydrocephalus.